副交感神經興奮時，可導致：①增加呼吸道阻力（airway resistance） ②降低呼吸道阻力 ③增加解剖性無效腔（anatomic dead space） ④降低解剖性無效腔
A. ①③
B. ①④
C. ②③
D. ②④

正確答案：B. ①④